Clinical trial exclusion criterion:
GFR < 40 ml/min/1.73m2 as measured by the MDRD formula

Annotated entities:
- Measurement: "GFR"
- Value: "< 40 ml/min/1.73m2"
- Qualifier: "MDRD formula"